下列何者不是造成兒童肝癌（hepatocellular carcinoma）的危險因子？
A. B 型肝炎（hepatitis B）垂直感染
B. 唐氏症（Down syndrome）
C. 肝醣貯積症（glycogen storage disease）
D. 膽道肝硬化（biliary cirrhosis）

正確答案：B. 唐氏症（Down syndrome）